Clinical trial exclusion criterion:
Untreated adrenal insufficiency.

Entity relations:
- Has_qualifier("adrenal insufficiency", "Untreated")